El calentamiento de ácido 4-metoxi-3,5dinitrobencenosulfónico con ácido sulfúrico diluido da:
1. 4-Metoxi-3,5-dinitrofenol.
2. Ácido 3,5–diamino-4- metoxibencenosulfónico.
3. Anhídrido del ácido 4-metoxi-3,5- dinitrobencenosulfónico
4. 2-Metoxi-1,3-dinitrobenceno.
5. Un catión orgánico.

Respuesta correcta: 4. 2-Metoxi-1,3-dinitrobenceno.